因腦瘤壓迫造成無法看到左眼內側視野及右眼外側視野的影像。此患者被腦瘤所壓迫的位置最可能為下列何者？
A. 右眼的視神經（optic nerve）
B. 視交叉（optic chiasm）
C. 左側的視神經路徑（optic tract）
D. 右側的視神經路徑（optic tract）

正確答案：C. 左側的視神經路徑（optic tract）